Clinical trial exclusion criterion:
Obesity (Body Mass Index > 30)

Annotated entities:
- Condition: "Obesity"
- Measurement: "Body Mass Index"
- Value: "> 30"